Clinical trial inclusion criterion:
Available Organ function: white blood cell=3.5×109/L, Neutrophils =1.5×109/L, Hemoglobin =80g/L, Blood platelet>100×109/L; Alanine aminotransferase (ALT) and Aspartate aminotransferase (AST)= 2.5 upper limit of normal(ULN); Total bilirubin (TBIL) <1.5 ULN;serum creatinine=1.5 ULN; creatinine clearance of = 50ml/min

Entity relations:
- Has_value("Blood platelet", ">100×109/L")
- Has_value("Hemoglobin", "=80g/L")
- Has_value("Neutrophils", "=1.5×109/L")
- Has_value("white blood cell", "=3.5×109/L")
- Has_value("Aspartate aminotransferase (AST)", "= 2.5 upper limit of normal(ULN)")
- Has_value("Alanine aminotransferase (ALT)", "= 2.5 upper limit of normal(ULN)")
- Has_value("Total bilirubin (TBIL)", "<1.5 ULN")
- Has_value("serum creatinine", "=1.5 ULN")
- Has_value("creatinine clearance", "= 50ml/min")